Anti-GAD antibodies negative (Glutamic Acid Decarboxylase)

The above is a clinical trial inclusion criterion. Annotated with entity spans:
[Measurement: Anti-GAD antibodies] [Value: negative] (Glutamic Acid Decarboxylase)